Clinical trial exclusion criterion:
Intestinal infection within 2 months before study entry.

Annotated entities:
- Condition: "Intestinal infection"
- Temporal: "within 2 months before study entry"
- Reference_point: "study entry"